Which disease is monitored in the BIOCURA cohort?

BiOCura cohort is used for clinical monitoring of rheumatoid arthritis.